How many pseudokinases are there in the human kinome?

There are approximately 50 pseudokinases in the human kinome.